Clinical trial inclusion criterion:
Be healthy for their age group with or without medication on the basis of physical examination, medical history, vital signs, and 12-lead electrocardiogram (ECG) performed at Screening or admission. Minor deviations in ECG, which are not considered to be of clinical significance to the investigator, are acceptable

Entity relations:
- Has_index("performed at Screening or admission", "Screening")
- Has_index("physical examination", "Screening")
- Has_qualifier("deviations in ECG", "which are not considered to be of clinical significance to the investigator")
- AND("deviations in ECG", "ECG")
- Has_index("performed at Screening or admission", "Screening")
- Has_index("performed at Screening or admission", "admission")
- OR("Screening", "admission")